Clinical trial exclusion criterion:
LVEF < 1 UNL

Entity relations:
- Has_value("LVEF", "< 1 UNL")